下列何種先天性心臟病（congenital heart disease），最少見到在新生兒出生一週內，即發生嚴重的發紺 （severe cyanosis）現象？
A. 大動脈轉位（transposition of the great arteries）
B. 單純型主動脈縮窄（simple coarctation of the aorta）
C. 左心發育不全症候群（hypoplastic left heart syndrome）
D. 全肺靜脈回流異常合併回流阻塞 （total anomalous pulmonary venous return with obstruction）

正確答案：B. 單純型主動脈縮窄（simple coarctation of the aorta）